Clinical trial exclusion criterion:
Serious medical or psychiatric illness that would interfere with the ability to adhere to study requirements

Annotated entities:
- Condition: "psychiatric illness"
- Condition: "medical illness"
- Qualifier: "Serious"
- Qualifier: "would interfere with the ability to adhere to study requirements"